下列何者是迷走神經所支配的器官？
A. 卵巢
B. 直腸
C. 子宮
D. 陰道

正確答案：A. 卵巢